Clinical trial exclusion criterion:
Other Medications: Participants who are taking other medications on a routine basis must be on a stable dose for at least 4 weeks prior to the Preliminary Screening Period (P1), and must intend to continue the medication at the same regimen for the duration of the trial unless lack of efficacy, safety, or tolerability dictates otherwise. The following medications are not excluded:

Annotated entities:
- Drug: "medications"
- Multiplier: "on a routine basis"
- Qualifier: "stable dose"
- Temporal: "for at least 4 weeks prior to the Preliminary Screening Period (P1)"
- Qualifier: "other"
- Non-representable: "The following medications are not excluded:"